Clinical trial exclusion criterion:
previous fracture in finger to be treated, which affects range of motion of MP or PIP joint

Entity relations:
- Has_temporal("fracture", "previous")
- Has_qualifier("fracture", "finger to be treated")
- Has_qualifier("affects range of motion", "MP joint")
- AND("fracture", "affects range of motion")
- OR("MP joint", "PIP joint")